Clinical trial exclusion criterion:
Atrioventricular block II and III in patients without pacemaker

Annotated entities:
- Condition: "Atrioventricular block II"
- Condition: "Atrioventricular block III"
- Negation: "without"
- Device: "pacemaker"